Clinical trial inclusion criterion:
Smoking history > 10 packs/year

Entity relations:
- Has_value("Smoking history", "> 10 packs/year")